Fistula with multiple tracts

The above is a clinical trial exclusion criterion. Annotated with entity spans:
[Condition: Fistula] with [Qualifier: multiple tracts]